Clinical trial exclusion criterion:
pregnant women in first trimester

Annotated entities:
- Condition: "pregnant"
- Person: "women"
- Condition: "first trimester"
- Qualifier: "first trimester"